Clinical trial inclusion criterion:
ASA physical status 1 or 2

Annotated entities:
- Measurement: "ASA physical status"
- Value: "1"
- Value: "2"